Señale la opción correcta respecto a la dosis diaria definida de un medicamento:
1. Corresponde a la dosis máxima diaria.
2. Corresponde a la dosis inicial de un tratamiento.
3. Corresponde a la dosis de mantenimiento para la indicación que requiera menor dosis.
4. Corresponde a la dosis media diaria de mantenimiento.
5. Corresponde a la dosis inicial para la indicación principal.

Respuesta correcta: 4. Corresponde a la dosis media diaria de mantenimiento.